Clinical trial inclusion criteria:
. Inclusion criteria are American Society of Anesthesiologists (ASA) physical status I-III, age between 18 and 70 years and body mass index (BMI) between 20 and 35 kg/m2.

Annotated entities:
- Measurement: "American Society of Anesthesiologists physical status"
- Measurement: "ASA"
- Value: "I-III"
- Person: "age"
- Value: "between 18 and 70 years"
- Measurement: "body mass index"
- Measurement: "BMI"
- Value: "between 20 and 35 kg/m2"